Hepatic dysfunction defined as serum AST and/or ALT> 3 times upper limit of normal (approximately 120 IU/L however, will vary depending on age),

The above is a clinical trial exclusion criterion. Annotated with entity spans:
[Condition: Hepatic dysfunction] defined as [Measurement: serum AST] and/or ALT[Value: > 3 times upper limit of normal] ([Value: approximately 120 IU/L] however, [Non-representable: will vary depending on age]),